Mujer de 30 años que acude a urgencias por pérdida de visión, dolor, ojo rojo y fotofobia de OI de 5 días de evolución. En el diagnóstico diferencial debes incluir todas estas patologías EXCEPTO una:
1. Uveítis anterior.
2. Úlcera corneal.
3. Iritis traumática.
4. Esclerouveítis.
5. Coriorretinopatía central serosa.

Respuesta correcta: 5. Coriorretinopatía central serosa.